Recent coronary artery intervention or other factors suggesting clinical instability (ECG, clinical or laboratory findings).

The above is a clinical trial exclusion criterion. Annotated with entity spans:
Recent [Procedure: coronary artery intervention] or other factors suggesting clinical instability (ECG, clinical or laboratory findings).